有關產後憂鬱症（postpartum depression）的敘述，何者正確？
A. 大部分於產後3～5天內發作
B. 很少會有傷害新生兒的想法
C. 終生罹患重鬱症的風險較高
D. 若不治療，通常於一個月內自行緩解

正確答案：C. 終生罹患重鬱症的風險較高